Clinical trial inclusion criterion:
Not attempting to conceive either at the time of study entry or for at least 2 years after surgery

Entity relations:
- Has_mood("conceive", "attempting")
- Has_negation("attempting", "Not")
- Has_temporal("conceive", "at the time of study entry")
- OR("at the time of study entry", "for at least 2 years after surgery")